1. Active thromboembolic disease, history of thromboembolic disease (including retinal vein or artery occlusion), known inherited thrombophilia, or family history of thrombosis in a first degree relative

The above is a clinical trial exclusion criterion. Annotated with entity spans:
1. [Temporal: Active] [Condition: thromboembolic disease], [Temporal: history] of [Condition: thromboembolic disease] (including [Condition: retinal vein] or [Condition: artery occlusion]), known [Condition: inherited thrombophilia], or [Observation: family history] of [Condition: thrombosis] [Observation: in a first degree relative]